Clinical trial inclusion criterion:
Effective methods of birth control include: surgically sterile, barrier device (condom, diaphragm), contraceptive coil, intrauterine device (IUD), and abstinence.

Entity relations:
- AND("barrier device", "condom")
- Subsumes("birth control", "surgically sterile")
- Subsumes("birth control", "and")
- OR("condom", "diaphragm")
- OR("surgically sterile", "barrier device", "contraceptive coil", "intrauterine device (IUD)", "abstinence")